一位 48 歲婦女，G3P2，經血量正常，經痛程度中等，在例行性抹片檢查為 CIN I，並且發現有一個子宮肌瘤 6 公分，卵巢疑似排卵不良。沒有頻尿及排便困難等症狀。下一步最適合的處置是什麼？
A. 追蹤六個月再檢查一次
B. 剖腹切除肌瘤手術
C. 注射 gonadotropin-releasing hormone（GnRH）agonists 療法
D. 腹腔鏡肌瘤切除手術

正確答案：A. 追蹤六個月再檢查一次